History of chickenpox or positive test for antibodies against varicella zoster virus (VZV)

The above is a clinical trial inclusion criterion. Annotated with entity spans:
History of [Condition: chickenpox] or [Value: positive] [Measurement: test for antibodies] against [Qualifier: varicella zoster virus] ([Qualifier: VZV])